NO es cierto respecto a la Artritis Reumatoide:
1. Es fundamental el diagnóstico precoz, un tratamiento intensivo y un control estrecho de la enfermedad.
2. El metotrexato es el fármaco de primera elección para controlar la actividad de la enfermedad.
3. El factor reumatoide es típico de la enfermedad y es un criterio obligado para el diagnóstico.
4. La especificidad de los anticuerpos anti péptidos citrulinados es muy elevada y tienen valor pronóstico.
5. Los fármacos biológicos, como los anti TNF, han revolucionado el tratamiento.

Respuesta correcta: 3. El factor reumatoide es típico de la enfermedad y es un criterio obligado para el diagnóstico.